Clinical trial exclusion criteria:
Newborns of substance abusing mothers.
Newborns with any contraindications to routine circumcision, anatomical or hematologic.

Annotated entities:
- Person: "Newborns"
- Person: "mothers"
- Condition: "substance abusing"
- Person: "Newborns"
- Condition: "contraindications"
- Procedure: "circumcision"